Diagnosis of Type 1 diabetes (for at least a year)

The above is a clinical trial inclusion criterion. Annotated with entity spans:
Diagnosis of [Condition: Type 1 diabetes] (for [Temporal: at least a year])